有關馬爾尼菲青黴菌（Talaromyces marneffer; formerly Penicillium memeffei）之敘述，下列何者正確？
A. 37℃呈絲狀菌（hyphae）形態
B. 具關節孢子（arthroconidia）
C. 不會呈現類酵母菌（yeast-like）型態
D. 主要感染途徑為呼吸道（respiratory tract）

正確答案：D. 主要感染途徑為呼吸道（respiratory tract）